Clinical trial exclusion criterion:
Ongoing cord compression or a syrinx in the spinal cord or who suffer from a spinal cord disease such as spinal stenosis, spina bifida, MS, or herniated disk

Annotated entities:
- Condition: "cord compression"
- Condition: "syrinx"
- Qualifier: "spinal cord"
- Condition: "spinal stenosis"
- Condition: "spinal cord disease"
- Condition: "spina bifida"
- Condition: "MS"
- Condition: "herniated disk"